Clinical trial exclusion criterion:
Therapy area was previously received isotope or PDT or other treatment which might interfere with the efficacy evaluation;

Annotated entities:
- Drug: "isotope"
- Drug: "PDT"
- Procedure: "treatment"
- Qualifier: "might interfere with the efficacy evaluation"